Clinical trial inclusion criterion:
between 16-25 years of age

Entity relations:
- Has_value("age", "16-25 years")